Serious organic or mental disease diagnosed by a psychiatrist (e.g., major depression currently treated with antidepressant medication) suspected on the basis of the medical history and/or clinical examination.

The above is a clinical trial exclusion criterion. Annotated with entity spans:
Serious [Condition: organic] or [Condition: mental disease] [Qualifier: diagnosed by a psychiatrist] (e.g., [Condition: major depression] [Temporal: currently] [Procedure: treated] with [Drug: antidepressant medication]) [Mood: suspected] on the basis of the [Temporal: medical history] and/or [Procedure: clinical examination].